Age : from 20 to 90 y/o.

The above is a clinical trial inclusion criterion. Annotated with entity spans:
[Person: Age] : from [Value: 20 to 90 y/o].